What percentage of human genes have no introns?

Intronless genes (IGs) constitute approximately 3% of the human genome.